何種 DNA 病毒之蛋白質可與調節細胞週期之 p105 RB 蛋白質作用：
A. 人類乳頭瘤病毒第十六型（HPV16）之 E6 蛋白質
B. 人類乳頭瘤病毒第十六型（HPV16）之 E7 蛋白質
C. 腺病毒之 E1B 蛋白質
D. EB 病毒潛伏性膜蛋白質第一型（LMP1）

正確答案：B. 人類乳頭瘤病毒第十六型（HPV16）之 E7 蛋白質